Clinical trial exclusion criterion:
Insulin requiring diabetes

Annotated entities:
- Drug: "Insulin"
- Procedure: "diabetes"